Female subjects aged =/> 18 years and of reproductive age.

The above is a clinical trial inclusion criterion. Annotated with entity spans:
[Person: Female] subjects [Person: aged] [Value: =/> 18 years] and of [Condition: reproductive age].